下列何種物質，對血液中酸鹼值調控的重要性 低？
A. 蛋白質
B. 硫酸氫根
C. 碳酸氫根
D. 血紅素

正確答案：B. 硫酸氫根